Any other clinical condition that, in the opinion of the investigator, might pose additional risk to the subject due to participation in the study.

The above is a clinical trial exclusion criterion. Annotated with entity spans:
[Non-representable: Any other clinical condition that, in the opinion of the investigator, might pose additional risk to the subject due to participation in the study.]